下列有關多發性硬化症（multiple sclerosis）的敘述，何者正確？
A. 典型的多發性硬化症發生於20～40歲的年輕人，而且男性明顯多於女性
B. 常見的症狀包括脊髓脫髓鞘病變、兩側聽神經麻痺及大面積類中風症狀
C. 多發性硬化症的患者時常在背部有類似電流流過的現象，這種現象常因向後伸展頸椎而得到舒緩，這種表徵稱為Lhermitte表徵
D. 某些多發性硬化症的患者在體溫升高的情形下會引發或加重其發作，這種現象稱為Uhthoff 現象

正確答案：D. 某些多發性硬化症的患者在體溫升高的情形下會引發或加重其發作，這種現象稱為Uhthoff 現象